下列有關血管畸形（Vascular malformation）的敘述，何者錯誤？
A. 胚胎期血管結構發生異常所致
B. 和血管瘤發生的原因類似
C. 全身器官都可能發生
D. 高流量的血管畸形後遺症較多，也較不易治療

正確答案：B. 和血管瘤發生的原因類似